Clinical trial inclusion criterion:
A pregnancy of unknown location is defined as a pregnancy in a woman with a positive pregnancy test but no definitive signs of pregnancy in the uterus or adnexa on ultrasound imaging. A definitive sign of gestation includes ultrasound visualization of a gestational sac with a yolk sac (with or without an embryo) in the uterus or in the adnexa. Ultrasound must be performed within 7 days prior to randomization.

Annotated entities:
- Condition: "pregnancy"
- Qualifier: "unknown location"
- Condition: "pregnancy"
- Person: "woman"
- Measurement: "pregnancy test"
- Value: "positive"
- Not_a_criteria: "A pregnancy of unknown location is defined as a pregnancy in a woman with a positive pregnancy test but no definitive signs of pregnancy in the uterus or adnexa on ultrasound imaging."
- Parsing_Error: "A definitive sign of gestation includes ultrasound visualization of a gestational sac with a yolk sac (with or without an embryo) in the uterus or in the adnexa."
- Procedure: "Ultrasound"
- Not_a_criteria: "A definitive sign of gestation includes ultrasound visualization of a gestational sac with a yolk sac (with or without an embryo) in the uterus or in the adnexa."
- Temporal: "within 7 days prior to randomization"
- Reference_point: "randomization"